Overlap syndrome with Primary Sclerosing Cholangitis (PSC) or Primary Biliary Cholangitis (PBC) (Paris criteria, strong positive Anti-Mitochondrial Antibodies (AMA), past liver biopsy or cholangiographic findings compatible with PBC or PSC).

The above is a clinical trial exclusion criterion. Annotated with entity spans:
[Condition: Overlap syndrome] with [Condition: Primary Sclerosing Cholangitis] ([Condition: PSC]) or [Condition: Primary Biliary Cholangitis] ([Condition: PBC]) ([Measurement: Paris criteria,] [Value: strong positive] [Measurement: Anti-Mitochondrial Antibodies] ([Measurement: AMA]), past [Procedure: liver biopsy] or [Procedure: cholangiographic findings] compatible with [Condition: PBC] or [Condition: PSC]).